下列何者不是機器手臂輔助內視鏡手術的特點？
A. 二維平面視野
B. 可以消除主刀者手術時手部晃動
C. 主刀者不需助手幫忙，可以自己調整鏡頭方向
D. 手術器械可以進入狹小空間，進行角度困難的動作

正確答案：A. 二維平面視野